下列何種絛蟲之受孕節片具有卵囊（egg capsules）？
A. 犬複殖器絛蟲（Dipylidium caninum）
B. 牛肉絛蟲（Taenia saginata）
C. 縮小包膜絛蟲（Hymenolepis diminuta）
D. 廣節裂頭絛蟲（Diphyllobothrium latum）

正確答案：A. 犬複殖器絛蟲（Dipylidium caninum）